¿Qué característica o dimensión de la atención es más relevante cuando el niño busca una pintura de color rojo en su estuche escolar lleno de pinturas de otros colores?
1. Orientación.
2. Flexibilidad.
3. Concentración.
4. Alerta.
5. Persistencia.

Respuesta correcta: 2. Flexibilidad.